Patients with any peripheral neuropathy or unresolved diarrhea greater than Grade 1

The above is a clinical trial exclusion criterion. Annotated with entity spans:
Patients with any [Condition: peripheral neuropathy] or [Condition: unresolved diarrhea] [Value: greater than] [Measurement: Grade] 1